Una chica de 20 años acude a la consulta con un cuadro agudo de fiebre, adenopatías cervicales y rash cutáneo. Según refiere la paciente, hace 3 semanas, tuvo una relación sexual que pudo ser de riesgo para contraer el virus del VIH. ¿Indica cuál de las siguientes respuestas es verdadera?
1. Una serología VIH-1/VIH-2 negativa realizada por medio de la técnica de ELISA, descarta la posibilidad de que la paciente haya sido contagiada con el virus VIH.
2. El proceso clínico que padece la paciente no concuerda con el de la infección aguda por VIH.
3. Si el test de ELISA de la paciente fuera positivo, no sería necesario realizar nada más para el diagnóstico de infección por VIH.
4. La técnica de ELISA tiene una alta sensibilidad para el diagnostico de infección por VIH, pero su especificidad es aún mayor.
5. Si el test de ELISA para diagnosticar VIH en la paciente fuera negativo, podríamos determinar por la técnica de PCR la carga viral en sangre.

Respuesta correcta: 5. Si el test de ELISA para diagnosticar VIH en la paciente fuera negativo, podríamos determinar por la técnica de PCR la carga viral en sangre.